Clinical trial inclusion criterion:
ASIA A, B,C and D

Annotated entities:
- Measurement: "ASIA"
- Value: "A, B,C and D"